¿En cuál de estas condiciones es más probable que una persona manifieste el efecto Stroop?:
1. Cuando debe decir “rojo” ante una serie de “Xs” escritas en tinta roja.
2. Cuando debe decir “rojo” ante la palabra “rojo “escrita en tinta roja.
3. Cuando debe decir “azul” ante la palabra “azul” escrita en tinta roja.
4. Cuando debe decir “rojo” ante la palabra “azul” escrita en tinta roja.

Respuesta correcta: 4. Cuando debe decir “rojo” ante la palabra “azul” escrita en tinta roja.